history of chronic pain or regular (at least once daily) opioid use preoperatively

The above is a clinical trial exclusion criterion. Annotated with entity spans:
history of [Condition: chronic pain] or regular ([Multiplier: at least once daily]) [Drug: opioid] use [Qualifier: preoperatively]